Clinical trial exclusion criterion:
The patients are undergoing current administration of anti-cancer therapies, or are attending other clinical trials.

Entity relations:
- OR("anti-cancer therapies", "attending other clinical trials")